chronic renal failure on dialysis

The above is a clinical trial exclusion criterion. Annotated with entity spans:
[Condition: chronic renal failure] on [Procedure: dialysis]